Clinical trial exclusion criterion:
NOTE: If APRI and FIB-4 are discordant one of the other forms of fibrosis staging must be used.

Annotated entities:
- Non-representable: "NOTE: If APRI and FIB-4 are discordant one of the other forms of fibrosis staging must be used."